Clinical trial exclusion criterion:
Patients with a history of any other malignancy.

Entity relations:
- Has_qualifier("malignancy", "any other")
- Has_temporal("malignancy", "history")